Clinical trial inclusion criterion:
Body mass index > 30Kg/m2 or > 27.5 Kg/m2 (South Asian),

Annotated entities:
- Measurement: "Body mass index"
- Value: "> 30Kg/m2"
- Value: "> 27.5 Kg/m2"